Hombre de 50 años, mecánico, consulta por cuadro de dos años de evolución de dificultad en manejar la mano derecha y sensación de rigidez en el brazo. Su mujer le nota la cara inexpresiva y refiere que tiene pesadillas nocturnas muy vívidas que le despiertan agitado. En la exploración destaca rigidez en extremidades derechas y marcha lenta y sin braceo derecho. ¿Cuál es el diagnostico más probable?
1. Infarto lacunar talámico izquierdo.
2. Esclerosis lateral amiotrófica.
3. Enfermedad de Parkinson.
4. Plexopatía cervical.
5. Degeneración corticobasal.

Respuesta correcta: 3. Enfermedad de Parkinson.